Clinical trial inclusion criterion:
Subject is at least 18 and not older than 75years old.

Annotated entities:
- Person: "old"
- Value: "at least 18 and not older than 75years"